Patients who had previously undergone operative therapy for the condition

The above is a clinical trial exclusion criterion. Annotated with entity spans:
[Competing_trial: Patients who had previously undergone operative therapy for the condition]